Written informed consent obtained from the subject or subject's legal representative

The above is a clinical trial inclusion criterion. Annotated with entity spans:
[Observation: Written informed consent] obtained [Qualifier: from the subject] or subject's legal representative